Clinical trial inclusion criterion:
Current use of a psychotropic nutraceutical (e.g. St John's wort)

Entity relations:
- AND("use", "psychotropic nutraceutical")
- Has_temporal("use", "Current")
- Subsumes("psychotropic nutraceutical", "St John's wort")